Which glands in the bee secretes royal jelly?

hypopharyngeal glands